Mild-to-moderate RDS;

The above is a clinical trial inclusion criterion. Annotated with entity spans:
[Value: Mild-to-moderate] [Measurement: RDS];